Clinical trial inclusion criteria:
ASA I-IV Age 55 or older Scheduled for operative repair of isolated intertrochanteric hip fracture

Annotated entities:
- Measurement: "ASA"
- Value: "I-IV"
- Person: "Age"
- Value: "55 or older"
- Mood: "Scheduled for"
- Procedure: "operative repair"
- Qualifier: "isolated"
- Condition: "intertrochanteric hip fracture"
- Multiplier: "isolated"
- Line: "Scheduled for operative repair of isolated intertrochanteric hip fracture"
- Line: "Age 55 or older"
- Line: "ASA I-IV"